Clinical trial exclusion criterion:
Patients who require endotracheal intubation without sedative medication. For example, patients in full cardiac arrest.

Annotated entities:
- Procedure: "endotracheal intubation"
- Observation: "require"
- Drug: "sedative medication"
- Negation: "without"
- Condition: "full cardiac arrest"